history of hypersensitivity to test drugs

The above is a clinical trial exclusion criterion. Annotated with entity spans:
[Temporal: history of] [Condition: hypersensitivity] to [Drug: test drugs]